Clinical trial exclusion criterion:
Taking other drugs which can influence the lipid profile (eg. Niacin, Fibrates;

Entity relations:
- multi("can influence the lipid profile", "lipid profile")
- Has_qualifier("drugs", "can influence the lipid profile")
- Has_qualifier("drugs", "other")
- AND("drugs", "Niacin")
- OR("Niacin", "Fibrates")